下列何者是A型血友病（hemophilia A）的起因？
A. tissue factor pathway inhibitor過度產生
B. prothrombin（factor II）基因缺陷
C. factor X無法被鈣離子活化
D. factor VIII基因缺陷

正確答案：D. factor VIII基因缺陷